Clinical trial exclusion criterion:
Patient has had a myocardial infarction within last two months.

Entity relations:
- Has_temporal("myocardial infarction", "last two months")